Clinical trial exclusion criterion:
Subject who, in the opinion of the investigator, will be noncompliant with the visit schedule or study procedures

Entity relations:
- AND("noncompliant with the visit schedule or study procedure", "in the opinion of the investigator")